Clinical trial inclusion criterion:
• Human leukocyte antigen B27 (HLA-B27)+ gene

Entity relations:
- Subsumes("gene Human leukocyte antigen B27", "(HLA-B27)+")